American Society of Anaesthesiologists (ASA) 2 and stable ASA 3 patients

The above is a clinical trial inclusion criterion. Annotated with entity spans:
[Measurement: American Society of Anaesthesiologists] ([Measurement: ASA]) [Value: 2] and [Qualifier: stable] [Measurement: ASA] [Value: 3] patients